Abnormal karyotype

The above is a clinical trial exclusion criterion. Annotated with entity spans:
[Condition: Abnormal karyotype]